Female patients with androgenetic alopecia.

The above is a clinical trial exclusion criterion. Annotated with entity spans:
[Person: Female] patients with [Condition: androgenetic alopecia].